What is BORSA?

Borderline oxacillin-resistant Staphylococcus aureus (BORSA).